Co-morbidities that require corticosteroid therapy (e.g. asthma, inflammatory bowel disease).

The above is a clinical trial exclusion criterion. Annotated with entity spans:
[Condition: Co-morbidities] that require [Drug: corticosteroid therapy] (e.g. [Condition: asthma], [Condition: inflammatory bowel disease]).